Clinical trial exclusion criterion:
Allergy or intolerance to clonidine

Annotated entities:
- Condition: "Allergy"
- Condition: "intolerance"
- Drug: "clonidine"